Clinical trial inclusion criteria:
Nursing homes will be eligible to participate if they meet the following criteria:
Licensed nursing home in Orange County or Southern Los Angeles County serving adults
Minimal use of chlorhexidine bathing*
Minimal use of nasal decolonization* *Minimal use defined as <15% of residents receiving at least one chlorhexidine bath or nasal decolonization treatment during their nursing home stay.

Annotated entities:
- Visit: "Nursing homes"
- Visit: "Licensed nursing home"
- Visit: "Orange County"
- Visit: "Southern Los Angeles County"
- Qualifier: "serving adults"
- Procedure: "chlorhexidine bathing"
- Drug: "chlorhexidine"
- Multiplier: "Minimal use"
- Multiplier: "Minimal use"
- Procedure: "nasal decolonization"
- Multiplier: "Minimal use"
- Value: "<15%"
- Measurement: "residents receiving at least one chlorhexidine bath"
- Multiplier: "at least one"
- Procedure: "chlorhexidine bath"
- Drug: "chlorhexidine"
- Procedure: "nasal decolonization treatment"
- Temporal: "during their nursing home stay"